¿Cuál de las siguientes características farmacocinéticas de la rosiglitazona NO es correcta?:
1. Tiene una biodisponibilidad del 99%
2. Los metabolitos inactivos se eliminan por orina previa conjugación o en forma de sulfatos.
3. No se debe prescribir en pacientes con afección hepática.
4. Es necesario reajustar su dosificación en presencia de enfermedad renal.
5. No se debe prescribirse a la madre lactante.

Respuesta correcta: 4. Es necesario reajustar su dosificación en presencia de enfermedad renal.